Clinical trial inclusion criterion:
participant's age 18 years or older at the time of signing the informed consent form

Annotated entities:
- Person: "age"
- Value: "18 years or older"
- Temporal: "at the time of signing the informed consent form"
- Reference_point: "signing the informed consent form"